Clinical trial exclusion criterion:
Pregnancy or breast feeding.

Entity relations:
- OR("Pregnancy", "breast feeding")